Clinical trial exclusion criterion:
Major neurological or medical illnesses that affect weight gain (e.g., unstable thyroid disease) or require a systemic medication that might impact weight or glucose regulation (e.g., diabetes mellitus [insulin], chronic renal failure [steroids]);

Entity relations:
- Has_qualifier("thyroid disease", "unstable")
- OR("thyroid disease", "diabetes mellitus", "chronic renal failure", "insulin", "steroids")